Explain the action of Balovaptan.

Balovaptan, an orally administered selective vasopressin V1a receptor antagonist which can penetrate the blood brain barrier.